Clinical trial exclusion criterion:
Patient with severe proctitis (MAYO score ≥ 11 at inclusion).

Entity relations:
- Has_qualifier("proctitis", "severe")
- Has_value("MAYO score", "≥ 11")
- Has_temporal("MAYO score", "at inclusion")
- Subsumes("severe", "MAYO score")